Clinical trial exclusion criterion:
Patients with diabetes, autoimmune diseases.

Entity relations:
- OR("diabetes", "autoimmune diseases")